Hypersensitivity or allergy to factor Xa inhibitors

The above is a clinical trial exclusion criterion. Annotated with entity spans:
[Condition: Hypersensitivity] or [Condition: allergy] to [Drug: factor Xa inhibitors]